Clinical trial exclusion criterion:
12. Hypersensitivity to caffeine, warfarin, vitamin K, omeprazole, dextromethorphan, midazolam, tipranavir, ritonavir or their excipients

Entity relations:
- AND("Hypersensitivity", "caffeine")
- OR("caffeine", "tipranavir", "midazolam", "dextromethorphan", "omeprazole", "vitamin K", "warfarin", "ritonavir")